Clinical trial exclusion criterion:
Having been diagnosed as HCC within the past 5 years

Annotated entities:
- Condition: "HCC"
- Temporal: "past 5 years"